Clinical trial exclusion criterion:
History or known presence of infectious causes of myelopathy (e.g., syphilis, Lyme disease, human T-lymphotropic virus 1 (HTLV-1), herpes zoster myelopathy)

Entity relations:
- AND("infectious causes", "myelopathy")
- Subsumes("infectious causes", "syphilis")
- OR("syphilis", "Lyme disease", "human T-lymphotropic virus 1 (HTLV-1)", "herpes zoster myelopathy")